Clinical trial inclusion criterion:
HbA1c < 10%;

Annotated entities:
- Measurement: "HbA1c"
- Value: "< 10%"